Clinical trial exclusion criterion:
Participation in any clinical studies within the last 4 weeks;

Annotated entities:
- Observation: "Participation in any clinical studies"
- Temporal: "within the last 4 weeks"